Clinical trial exclusion criterion:
Patients with orthopedic or neuromuscular disorders that preclude participation in exercise.

Entity relations:
- OR("neuromuscular disorders", "disorders orthopedic")